Female subjects' serum pregnancy test performed at the screening visit and urine pregnancy test performed at the baseline visit must be negative.

The above is a clinical trial inclusion criterion. Annotated with entity spans:
[Pregnancy_considerations: Female subjects' serum pregnancy test performed at the screening visit and urine pregnancy test performed at the baseline visit must be negative.]